Clinical trial exclusion criterion:
FEV1/SVC>=70%

Annotated entities:
- Measurement: "FEV1/SVC"
- Value: ">=70%"